Tomamos una muestra aleatoria simple de 1000 personas, y para cada una comprobamos si enfermó o no de gripe el año 2012 y si se vacunó o no de la gripe el año 2012. Obtuvimos así dos respuestas para cada una de las 1000 personas. Para evaluar si hay asociación entre estas dos variables cualitativas (tener gripe o no) y (haberse vacunado o no) a partir de los datos de nuestra muestra:
1. Dibujamos un gráfico cuantil-cuantil.
2. Realizamos una prueba t para diferencia de medias.
3. Calculamos el coeficiente de correlación de Pearson.
4. Realizamos un contraste de los signos para la diferencia de medianas.
5. Realizamos una tabla de contingencia y una prueba de independencia.

Respuesta correcta: 5. Realizamos una tabla de contingencia y una prueba de independencia.